Clinical trial inclusion criterion:
2. Male, 35-80 years; female, postmenopausal to 80 years;

Annotated entities:
- Person: "Male"
- Person: "35-80 years"
- Value: "35-80 years"
- Person: "female"
- Condition: "postmenopausal"
- Person: "to 80 years"
- Value: "to 80 years"